Clinical trial exclusion criterion:
Participants with congenital or acquired hypogonadism for whom long-term therapy with placebo would not be medically appropriate

Entity relations:
- OR("congenital hypogonadism", "acquired hypogonadism")